Clinical trial exclusion criterion:
Contralateral phrenic nerve palsy

Entity relations:
- Has_qualifier("phrenic nerve palsy", "Contralateral")